Special needs participants who are unable to comprehend study-related instructions (eg, mild to profound mental retardation [intelligence quotient <70], moderate to severe cognitive developmental delay, pervasive development disorders, autism)

The above is a clinical trial exclusion criterion. Annotated with entity spans:
[Observation: Special needs] participants who are [Observation: unable to comprehend] [Qualifier: study-related] instructions (eg, [Qualifier: mild to profound] [Condition: mental retardation] [[Measurement: intelligence quotient] [Value: <70]], [Qualifier: moderate to severe] [Condition: cognitive developmental delay], [Condition: pervasive development disorders], [Condition: autism])